Clinical trial inclusion criterion:
Individuals of both sexes from 18 years with a diagnosis of community-acquired pneumonia, COPD or Bronchial Asthma;

Annotated entities:
- Person: "both sexes"
- Value: "from 18 years"
- Person: "from 18 years"
- Condition: "community-acquired pneumonia"
- Condition: "COPD"
- Condition: "Bronchial Asthma"